有關處置外陰癌（vulvar cancer），最近的處置原則，不包括下列何者？
A. 對所有的病患都應該根據其狀況，做個別式（individualization）的治療
B. 不必一定要執行常規（routine）的骨盆腔淋巴結去除手術（pelvic lymph node dissection）
C. 針對腹股溝淋巴有轉移（multiple positive groin nodes）的病患，手術後的放射線治療是必須的。目的要降低腹股溝（groin）處的復發。因為這類病患一旦有腹股溝處的復發，幾乎均會死亡
D. 因爲外陰癌（vulvar cancer）的病患，淋巴的轉移，是沿	腹股溝的淋巴結轉移，應常規執行外陰癌根除術及雙側的腹股溝淋巴結去除手術（groin lymph nodes  dissection）

正確答案：D. 因爲外陰癌（vulvar cancer）的病患，淋巴的轉移，是沿	腹股溝的淋巴結轉移，應常規執行外陰癌根除術及雙側的腹股溝淋巴結去除手術（groin lymph nodes  dissection）